Clinical trial exclusion criterion:
Treatment with GLP-1 analogues, Dipeptidyl peptidase-4 inhibitors, or glitazones

Entity relations:
- OR("GLP-1 analogues", "Dipeptidyl peptidase-4 inhibitors", "glitazones")